李小姐因罹患零期乳部腫瘤，至 A 醫院實施左側乳房徹底根切除術，手術後接受常規性抗生素治療，不幸因藥物不良反應致死，病人可能可以申請何種救濟？
A. 藥害救濟
B. 疫苗救濟
C. 沒有法定的救濟途徑
D. 藥害貸款

正確答案：A. 藥害救濟